Clinical trial exclusion criterion:
Patient who is HCV negative has received an HCV positive (HCV RNA by PCR or HCV antibody) donor liver

Annotated entities:
- Measurement: "HCV"
- Value: "negative"
- Qualifier: "liver"
- Measurement: "HCV"
- Value: "positive"
- Person: "donor"
- Measurement: "HCV RNA"
- Measurement: "HCV antibody"
- Measurement: "PCR"